Clinical trial exclusion criterion:
comorbid psychotic, bipolar, substance use dependence, Alzheimer's or dementia

Annotated entities:
- Condition: "psychotic"
- Condition: "bipolar"
- Condition: "substance use dependence"
- Condition: "Alzheimer's"
- Condition: "dementia"
- Temporal: "comorbid"